Clinical trial exclusion criterion:
9. Baseline creatinine >20% above the upper limit of normal for age

Entity relations:
- Has_value("creatinine", ">20% above the upper limit of normal for age")
- Has_temporal("creatinine", "Baseline")